Clinical trial inclusion criterion:
25-50 years of age

Entity relations:
- Has_value("age", "25-50 years")